有關心導管檢查中各種壓力測量數據的敘述，下列何者正確？
A. 正常平均（mean）肺動脈壓力為30～40 mmHg
B. 緊縮性（constrictive）心外膜炎跟限制性（restrictive）心肌病變不同，其右心室舒張末壓應小於右心室收縮壓之1/3
C. 肺微血管楔壓（wedge pressure）在二尖瓣狹窄病人，可間接代表左心室舒張末壓
D. 欲計算得到體循環血管阻力（systemic vascular resistence），需測得心輸出量、平均主動脈壓及平均右心房

正確答案：D. 欲計算得到體循環血管阻力（systemic vascular resistence），需測得心輸出量、平均主動脈壓及平均右心房